composite head and neck tumor resection

The above is a clinical trial inclusion criterion. Annotated with entity spans:
[Procedure: composite head and neck tumor resection]